What is apelin?

Apelin, a small regulatory peptide, is the endogenous ligand for the apelin receptor (APJ) receptor.